Clinical trial inclusion criterion:
Lack of sensitization (i.e. PRA < 20%) that would be expected to result in a high likelihood of needing aggressive immunosuppression to treat rejection

Annotated entities:
- Negation: "Lack of"
- Condition: "sensitization"
- Measurement: "PRA"
- Value: "< 20%"
- Non-representable: "that would be expected to result in a high likelihood of needing aggressive immunosuppression to treat rejection"